Clinical trial exclusion criterion:
Patients with fibromyalgia or chronic pain syndromes such as rheumatoid arthritis, osteoarthritis, or lupus.

Entity relations:
- Subsumes("chronic pain syndromes", "rheumatoid arthritis")
- OR("rheumatoid arthritis", "osteoarthritis", "lupus")
- OR("fibromyalgia", "chronic pain syndromes")